下列有關尿路分流（urinary diversion）手術的敘述，何者錯誤？
A. 手術前的心肺功能評估很重要
B. 手術前必須做腸道清洗準備
C. 當膀胱癌有前列腺段尿道侵犯時，尿路分流手術最好採用neobladder方式
D. 迴腸因為長度最長，最常被選用於尿路分流手術

正確答案：C. 當膀胱癌有前列腺段尿道侵犯時，尿路分流手術最好採用neobladder方式